Clinical trial inclusion criterion:
Inflammatory arthritis patients who plan to treat with biological agents, including Humira or Enbrel or Simponi or Orencia or Mabthera or Actemra; as first line biologic treatment is indicated.

Entity relations:
- AND("Inflammatory arthritis", "biological agents")
- AND("biological agents", "Humira")
- OR("Humira", "Enbrel", "Simponi", "Orencia", "Mabthera", "Actemra")